下列有關阿米巴之敘述中，何者正確？
A. 嗜碘阿米巴（Iodamoeba bütschlii）的滋養體（trophozoites）具有一個很大的肝醣泡（glycogen
B. 哈氏阿米巴（Entamoeba hartmanni）的滋養體（trophozoites）也會吞噬紅血球
C. 痢疾阿米巴（Entamoeba histolytica）感染之高危險群包括男同性戀者及啟智、精神教養院生
D. 痢疾阿米巴（Entamoeba histolytica）的囊體中的類染色體（chromatoid bodies）之成分是DNA

正確答案：C. 痢疾阿米巴（Entamoeba histolytica）感染之高危險群包括男同性戀者及啟智、精神教養院生